Pregnant women and young children aged <18 years;

The above is a clinical trial exclusion criterion. Annotated with entity spans:
Pregnant [Person: women] and [Person: young children] [Person: aged] [Value: <18 years];